En los linfocitos NK humanos, el marcador CD16 es funcionalmente:
1. Una molécula de adhesión superficial.
2. Un tipo de receptor antigénico.
3. Un receptor inhibidor.
4. Un receptor para IgG.

Respuesta correcta: 4. Un receptor para IgG.